Which network analysis method can you use for prioritization of metabolic disease genes?

Met Propagate is a network-based approach that uses untargeted metabolomics (UM) data from a single patient and a group of controls to prioritize candidate genes in patients with suspected IEMs.